Clinical trial exclusion criterion:
life expectancy of less than 18months

Annotated entities:
- Observation: "life expectancy"
- Value: "less than 18months"